Clinical trial inclusion criterion:
Must meet the following definition for adhesive capsulitis as defined by the American Academy of Orthopedic Surgeons: Self-limiting condition resulting from any inflammatory process about the shoulder in which capsular scar tissue is produced, resulting in pain and limited range of motion; also called frozen shoulder

Annotated entities:
- Condition: "adhesive capsulitis"
- Measurement: "American Academy of Orthopedic Surgeons"
- Non-query-able: "Self-limiting condition resulting from any inflammatory process about the shoulder in which capsular scar tissue is produced, resulting in pain and limited range of motion; also called frozen shoulder"